Clinical trial exclusion criterion:
Electrolyte imbalance (hypocalcaemia, hyponatremia and hypoglycemia)

Annotated entities:
- Condition: "Electrolyte imbalance"
- Condition: "hypocalcaemia"
- Condition: "hyponatremia"
- Condition: "hypoglycemia"